Children undergoing ENT surgery under general anaesthesia.

The above is a clinical trial inclusion criterion. Annotated with entity spans:
[Person: Children] [Temporal: undergoing] [Procedure: ENT surgery] under [Procedure: general anaesthesia].